Treatment with antineoplastic or immunosuppressive drugs within 8 weeks prior to study inclusion

The above is a clinical trial exclusion criterion. Annotated with entity spans:
[Procedure: Treatment] with [Drug: antineoplastic] or [Drug: immunosuppressive drugs] [Temporal: within 8 weeks prior to study inclusion]